Clinical trial exclusion criterion:
10. Single vessel (single territory) disease.

Entity relations:
- Subsumes("Single vessel disease", "single territory disease")